Clinical trial exclusion criterion:
Anemia (hemoglobin < 9 mg/dl) or thrombocytopenia (Platelet count <75), or thrombocytosis (Platelet count >600)

Entity relations:
- Has_value("hemoglobin", "< 9 mg/dl")
- Has_value("Platelet count", "<75")
- Has_value("Platelet count", ">600")
- Subsumes("thrombocytosis", "Platelet count")
- Subsumes("thrombocytopenia", "Platelet count")
- Subsumes("Anemia", "hemoglobin")
- OR("Anemia", "thrombocytopenia", "thrombocytosis")